7. Meet current DSM V criteria for moderate to severe substance use disorder (excluding nicotine), smoke daily, or urine toxicology positive for any illicit substance inconsistent with history given.

The above is a clinical trial exclusion criterion. Annotated with entity spans:
[Parsing_Error: 7.] [Value: Meet] current [Measurement: DSM V criteria] for [Qualifier: moderate to severe] [Condition: substance use disorder] ([Negation: excluding] [Drug: nicotine]), [Observation: smoke daily], or [Measurement: urine toxicology] [Value: positive] for any [Drug: illicit substance] [Qualifier: inconsistent with history] given.